En una potenciometría a intensidad nula el electrodo:
1. Indicador mide siempre potenciales de equilibrio.
2. Indicador mide el potencial de semionda.
3. Indicador puede medir un potencial mixto.
4. De referencia es siempre un electrodo de platino calomelanos.
5. Indicador es siempre un electrodo de platino.

Respuesta correcta: 3. Indicador puede medir un potencial mixto.